El desplazamiento celular por reptación depende de:
1. Cilios.
2. Estereocilios.
3. Flagelos.
4. Filamentos de actina.
5. Microvellosidades.

Respuesta correcta: 4. Filamentos de actina.